Which gene is responsible for red hair?

Melanocortin-1 receptor (MC1R) gene variants are associated with fair skin and red hair.